Clinical trial exclusion criterion:
Blood pressure taken at screening and randomization is = 180 mmHg for siSBP or = 110 mmHg for siDBP.

Entity relations:
- Has_value("siSBP", "= 180 mmHg")
- Has_value("siDBP", "= 110 mmHg")
- AND("Blood pressure", "siSBP")
- Has_temporal("Blood pressure", "at randomization")
- Has_temporal("Blood pressure", "at screening")
- OR("siSBP", "siDBP")